Clinical trial inclusion criterion:
Clinical/ Histological/ cytological/ Imaging examination proven Oral/Oropharynx Squamous-cell carcinoma (Tongue, buccal mucosa, mouth floor, hard palate, Molar area), the depth of invasion > 4mm in preoperative assessment

Entity relations:
- Has_qualifier("Squamous-cell carcinoma", "Oral")
- Subsumes("Oral", "Tongue")
- Has_value("depth of invasion", "> 4mm")
- AND("preoperative assessment", "depth of invasion")
- AND("Squamous-cell carcinoma", "preoperative assessment")
- AND("Squamous-cell carcinoma", "Clinical examination")
- OR("Oral", "Oropharynx")
- OR("Tongue", "buccal mucosa", "mouth floor", "hard palate", "Molar area")
- OR("Clinical examination", "Histological examination", "Imaging examination", "cytological examination")